一位籃球選手上籃時被犯規，跌到地上時，用右手撐地，結果造成尺骨近端骨折合併「橈骨頭」骨折脫臼，在急診室經過骨科醫師施行閉鎖性復位後，檢查發現在腕關節也有脫臼的現象，請問造成這種所謂 Essex-Lopresti 病灶的原因，最有可能是什麼構造被破壞？
A. 環狀韌帶破裂
B. 腕關節之三角韌帶撕裂
C. 橈、尺骨之間的骨間膜撕裂
D. 腕關節之舟狀骨骨折

正確答案：C. 橈、尺骨之間的骨間膜撕裂